Unable to understand or sign consent form

The above is a clinical trial exclusion criterion. Annotated with entity spans:
[Post-eligibility: Unable to understand or sign consent form]